Clinical trial inclusion criterion:
The patient receive radical operation for colon cancer with negative margin.

Entity relations:
- AND("radical operation negative margin", "colon cancer")